60歲的女病患主訴右膝關節腫脹及輕微疼痛已2週。抽出關節液檢	，其外表黃色透明，黏稠度（viscosity）甚高，白血球濃度為250 cells/mm3。最適宜的診斷為何？
A. 痛風性關節炎
B. 退化性關節炎
C. 細菌性關節炎
D. 乾癬性關節炎

正確答案：B. 退化性關節炎